Clinical trial exclusion criterion:
Positive urine toxicology screen for substances of non-therapeutic use prior to craving assessments

Annotated entities:
- Measurement: "urine toxicology screen"
- Qualifier: "substances of non-therapeutic use"
- Value: "Positive"
- Temporal: "prior to craving assessments"
- Reference_point: "craving assessments"